第一孕期唐氏症及其他非整倍體（aneuploidy）染色體異常，最常用的篩檢策略為超音波檢查及母血血清分析，下列檢查何者不屬之？
A. 頸部透明帶厚度（nuchal translucency）檢測
B. 母血胎兒甲型蛋白（maternal serum AFP）
C. 人類絨毛膜性腺激素（human chorionic gonadotropin）
D. 懷孕相關蛋白A（pegnancy-associated protein A）

正確答案：B. 母血胎兒甲型蛋白（maternal serum AFP）